Clinical trial inclusion criterion:
Patients with Moderate to Advanced Chronic periodontitis

Annotated entities:
- Condition: "Chronic periodontitis"
- Qualifier: "Advanced"
- Qualifier: "Moderate"